Patients with sepsis.

The above is a clinical trial exclusion criterion. Annotated with entity spans:
Patients with [Condition: sepsis].